Un análisis electrogravimétrico se basa en que:
1. La eficiencia en corriente sea del 100%.
2. Se debe utilizar siempre un sistema potenciostático.
3. La electrólisis se hace a potencial constante.
4. Se deposita el analito en forma de sólido sobre la superficie del electrodo.

Respuesta correcta: 4. Se deposita el analito en forma de sólido sobre la superficie del electrodo.